Clinical trial exclusion criterion:
Known or suspected systemic hypersensitivity to any of the vaccine components, or history of a life-threatening reaction to the vaccine used in the trial or to a vaccine containing any of the same substances

Annotated entities:
- Condition: "systemic hypersensitivity"
- Drug: "vaccine components"
- Temporal: "history"
- Condition: "life-threatening reaction"
- Drug: "vaccine"
- Drug: "vaccine"
- Qualifier: "used in the trial"
- Context_Error: "used in the trial"
- Context_Error: "Known or suspected systemic hypersensitivity to any of the vaccine components, or history of a life-threatening reaction to the vaccine used in the trial or to a vaccine containing any of the same substances"